Clinical trial inclusion criterion:
Respiratory muscle weakness (Pi,max < 70cmH2O)

Entity relations:
- Has_value("Pi,max", "< 70cmH2O")